Clinical trial exclusion criteria:
asthma and COPD

Annotated entities:
- Condition: "asthma"
- Condition: "COPD"